List side effects of radiation therapy?

radiation-induced tumors
radiation necrosis
microangiopathy
progressive leukencephalopathy
pneumonitis
disturbance of the blood-brain barrier
radionecrosis of brain tissue
radiogenic liver damage
mucositis
colitis
osteitis
osteoradionecrosis
myositis
Radiation-induced fibrosis
Acute skin reactions